Clinical trial exclusion criterion:
Inability to fully comprehend and/or perform study procedures in the investigator's opinion.

Annotated entities:
- Post-eligibility: "Inability to fully comprehend and/or perform study procedures in the investigator's opinion"